Clinical trial exclusion criterion:
Treatment with IV antibiotics in the 6 weeks prior to Visit 1

Entity relations:
- Has_index("in the 6 weeks prior to Visit 1", "Visit 1")
- Has_temporal("IV antibiotics", "in the 6 weeks prior to Visit 1")